下列何種職業病，最有可能在胸部電腦斷層攝影 HRCT，看到肋膜下 5 至 10 公分長度的曲線鈣化  （subpleural curvilinear line）？
A. asbestosis
B. silicosis
C. coal worker's pneumoconiosis（CWP）
D. berylliosis

正確答案：A. asbestosis